En el ámbito de los procesos de selección de personal, los Assessment Center son:
1. Entrevistas estructuradas.
2. Test individuales de lápiz y papel.
3. Test colectivos utilizados como primer cribado.
4. Procedimientos que implican la observación comportamental en situaciones laborales creadas al efecto.

Respuesta correcta: 4. Procedimientos que implican la observación comportamental en situaciones laborales creadas al efecto.